下列何反應與迷走神經無關？
A. 咳嗽反射
B. 肺擴張反射（Hering-Breuer inflation reflex）
C. 抑制肺泡type II肺泡上皮分泌
D. 支氣管平滑肌收縮

正確答案：C. 抑制肺泡type II肺泡上皮分泌